Hepatitis B infection.

The above is a clinical trial exclusion criterion. Annotated with entity spans:
[Condition: Hepatitis B infection].